¿Qué tipo de ploidia define a un individuo 2n2?:
1. Monosomía doble.
2. Tetrasomía.
3. Trisomía
4. Nulisomía.
5. Triploidía.

Respuesta correcta: 4. Nulisomía.